下列何者為唐氏症兒（Down syndrome）最常合併之心臟病？
A. 心房中膈缺損（atrial septal defect）
B. 開放性動脈導管（patent ductus arteriosus）
C. 法洛式四合症（tetralogy of Fallot）
D. 房室內墊缺損（endocardial cushion defect）

正確答案：D. 房室內墊缺損（endocardial cushion defect）